Use of blood products within 12 months before the vaccination;

The above is a clinical trial exclusion criterion. Annotated with entity spans:
Use of [Drug: blood products] [Temporal: within 12 months before the vaccination];